一位 14 歲國中女生患有脊椎側彎症，X 光片顯示其脊椎最大彎曲點在第一腰椎，柯卜氏角度  （Cobb's angle）為 35 度，請問下列何種處置最為重要？
A. 運動治療（exercise therapy）
B. 背架（spinal brace）矯正
C. 骨盆束帶（pelvic band）與牽引治療（traction therapy）
D. 手術治療

正確答案：B. 背架（spinal brace）矯正